What is Hikikomori syndrome?

Hikikomori syndrome is a Japanese culture-bound syndrome and a serious social problem in Japan. It is a condition in which a subject locks himself/self into a house for a prolonged period of time for the period of 6 months or more, with no evident psychosis.